El ácido etilendiaminotetraacético (EDTA) es un agente quelante ampliamente utilizado como valorador en valoraciones complexométricas que se caracterizan porque:
1. Para hacer posible la valoración con EDTA de muchos metales en disoluciones alcalinas se utiliza un agente complejante auxiliar que impide que el ión metálico precipite como hidróxido.
2. El EDTA forma complejos de estequiometría 1:2 con algunos iones metálicos y por ello tiene una aplicación escasa en análisis cuantitativo.
3. Es importante elegir un adecuado pH para llevar a cabo la valoración porque los complejos metal-EDTA son más estables a pH bajo que a pH alto.
4. Al valorar un ión metálico con EDTA, en el punto de equivalencia hay un exceso de EDTA.
5. Al valorar un ión metálico con EDTA, en el punto de equivalencia hay un exceso de ión metálico.

Respuesta correcta: 1. Para hacer posible la valoración con EDTA de muchos metales en disoluciones alcalinas se utiliza un agente complejante auxiliar que impide que el ión metálico precipite como hidróxido.